下列有關低血鈉症（hyponatremia）的描述，何者正確？
A. 如果血漿滲透壓（osmolality）偏低，應考慮是否有高血糖
B. 心臟衰竭可能造成細胞外體液（extracellular fluid）增加及低血鈉
C. 低血鈉及細胞外體液減少的病人，若尿液鈉離子濃度低於10 mmol/L，代表有Na+ wasting nephropathy
D. 抗利尿激素不適當分泌（SIADH）的病人通常血漿滲透壓正常，但細胞外體液減少

正確答案：B. 心臟衰竭可能造成細胞外體液（extracellular fluid）增加及低血鈉